¿Cuál de las siguientes observaciones es interpretada exclusivamente por la existencia de fuerzas de dispersión o fuerzas de London?:
1. El punto de ebullición normal de H2O es más alto que el de H2S.
2. El helio gas puede licuarse.
3. El hielo es menos denso que el agua líquida.
4. El cloruro de hidrógeno es polar.

Respuesta correcta: 2. El helio gas puede licuarse.